kidney transplant recipient

The above is a clinical trial inclusion criterion. Annotated with entity spans:
[Procedure: kidney transplant] recipient